2. Man

The above is a clinical trial exclusion criterion. Annotated with entity spans:
[Parsing_Error: 2.] [Person: Man]